Patients already been registered with other studies; or

The above is a clinical trial exclusion criterion. Annotated with entity spans:
[Competing_trial: Patients already been registered with other studies; or]